Clinical trial exclusion criterion:
Patients with surgical or medical intestinal diseases or having received surgeries that could interfere with drug absorption distribution, metabolism and elimination

Annotated entities:
- Condition: "intestinal diseases"
- Qualifier: "surgical"
- Qualifier: "medical"
- Procedure: "surgeries"
- Qualifier: "could interfere with drug absorption distribution"
- Qualifier: "could interfere with drug metabolism"
- Qualifier: "could interfere with drug elimination"